What percentage of C. elegans genes reside in operons?

About 15% of all C. elegans genes reside in operons.  URL_0   > Nearly 15 percent of the ~20,000 C. Elegans genes are contained in operon, multigene clusters controlled by a single promoter.